Clinical trial exclusion criterion:
Use of intravenous amiodarone or lidocaine in the last 24 hours

Entity relations:
- Has_temporal("amiodarone", "in the last 24 hours")
- Has_qualifier("amiodarone", "intravenous")
- OR("amiodarone", "lidocaine")